Clinical trial exclusion criterion:
Established ischemic heart disease, peripheral arterial disease and/or cerebrovascular disease.

Annotated entities:
- Condition: "ischemic heart disease"
- Condition: "peripheral arterial disease"
- Condition: "cerebrovascular disease"